Clinical trial inclusion criteria:
1. age 18-65 years, inclusive
2. diagnosis of moderate to severe AT, confirmed by Dr. Wilson using clinical symptoms and exam findings consistent with chronic AT (>6 month duration) - which includes pain while palpating the intratendinous swelling part of the Achilles tendon and relief of pain when tendon placed under tension - and pre-procedure US
3. self-reported AT-related pain for at least 6 months and VAS (Visual Analog Scale) pain >5 (0-10 scale)
4. self-reported failure of eccentric exercise protocol (at least 75% completion)
5. self-reported failure of at least 2 of the 3 most common treatments for AT (NSAIDS, rest/ice or taping)
6. patient considered surgery but decided to wait and/or refused surgery -

Annotated entities:
- Value: "18-65 years, inclusive"
- Person: "age"
- Qualifier: "moderate to severe"
- Condition: "AT"
- Non-query-able: "confirmed by Dr. Wilson"
- Condition: "chronic AT"
- Temporal: ">6 month duration"
- Condition: "pain while palpating the intratendinous swelling part of the Achilles tendon"
- Condition: "relief of pain when tendon placed under tension"
- Condition: "AT-related pain"
- Observation: "self-reported"
- Temporal: "for at least 6 months"
- Measurement: "VAS (Visual Analog Scale) pain"
- Value: ">5"
- Qualifier: "0-10 scale"
- Condition: "failure of eccentric exercise protocol"
- Value: "at least 75%"
- Observation: "self-reported"
- Observation: "self-reported"
- Condition: "failure of at least 2 of the 3 most common treatments for AT"
- Drug: "NSAIDS"
- Procedure: "rest"
- Drug: "ice"
- Procedure: "taping"
- Procedure: "surgery"
- Parsing_Error: "patient considered surgery but decided to wait and/or refused surgery -"